Contraindication to aspirin or P2Y12 receptor antagonist

The above is a clinical trial exclusion criterion. Annotated with entity spans:
[Condition: Contraindication] to [Condition: aspirin] or [Condition: P2Y12 receptor antagonist]